人類睡眠與覺醒之間的轉換由reticular activating system中多處神經核調控，其中當pontine reticular formation釋出的那一種最主要神經傳導物質減少時，會促使人們傾向清醒的狀態？
A. norepinephrine
B. serotonin
C. acetylcholine
D. histamine

正確答案：C. acetylcholine